Clinical trial inclusion criterion:
Subjects who understand and voluntarily sign an informed consent form

Annotated entities:
- Post-eligibility: "Subjects who understand and voluntarily sign an informed consent form"
- Non-query-able: "Subjects who understand and voluntarily sign an informed consent form"